Age 18 or above, or of legal age to give informed consent specific to state and national law

The above is a clinical trial inclusion criterion. Annotated with entity spans:
[Person: Age] [Value: 18 or above], or [Value: of legal age] to give informed consent specific to state and national law